Clinical trial inclusion criterion:
Adequate performance status:

Annotated entities:
- Measurement: "performance status"
- Value: "Adequate"
- Non-representable: "Adequate performance status"